一位45歲女性接受篩檢乳房攝影  ( screening mammography )，發現有聚集微細鈣化 ( clustered microcalcification ) 屬 BI-RADS Ⅳ，乳房觸診未發現有硬塊，下列處置何者不宜？
A. 安排定位切片手術 ( wire-localized surgical excision )
B. 安排立體定位粗針穿刺 ( stereotactic core needle biopsy )
C. 三至六個月後再追蹤乳房攝影
D. 安排乳房超音波檢查，確認有無乳房腫瘤存在

正確答案：C. 三至六個月後再追蹤乳房攝影